有關多發性肌炎（polymyositis）的敘述，下列何者正確？
A. statin類藥物會引發類似polymyositis的表現
B. 在大於50歲的發炎性肌肉病變（inflammatory myopathies）患者中，polymyositis是最常見的診斷
C. 關節攣縮（joint contractures）常發生於polymyositis
D. 皮下鈣化（subcutaneous calcifications）常發生於polymyositis

正確答案：A. statin類藥物會引發類似polymyositis的表現